Clinical trial exclusion criterion:
5. non reassuring fetal heart rate.

Entity relations:
- Has_qualifier("fetal heart rate", "non reassuring")